Clinical trial inclusion criterion:
Macula edema secondary to BRVO

Annotated entities:
- Condition: "Macula edema"
- Condition: "BRVO"